Clinical trial inclusion criterion:
Able to understand and provide consent in English or Spanish

Annotated entities:
- Post-eligibility: "Able to understand and provide consent in English or Spanish"